一位 42 歲女性，有陣發性的高血壓、頭痛和流汗。24 小時尿液測定發現 VMA（vanillylmandelic acid）高，但腎上腺的電腦斷層攝影卻看不到腫瘤。則下一步做何種檢查最適宜？
A. 131I- metaiodobenzylguanidine（MIBG）核子醫學掃描
B. 胸部電腦斷層攝影
C. 胸部核磁共振攝影（MRI）
D. 99mTc-Sestamibi 核子醫學掃描

正確答案：A. 131I- metaiodobenzylguanidine（MIBG）核子醫學掃描